Clinical trial exclusion criterion:
Other conditions that would limit clinical assessment of outcomes (e.g. dementia, demyelinating disease, autoimmune disease, etc)

Entity relations:
- OR("dementia", "demyelinating disease", "autoimmune disease")